Renal dysfunction (CrCl < 30ml/min).

The above is a clinical trial exclusion criterion. Annotated with entity spans:
[Condition: Renal dysfunction] ([Measurement: CrCl] [Value: < 30ml/min]).